Creatinine >= 2 x upper limit of normal (ULN)

The above is a clinical trial exclusion criterion. Annotated with entity spans:
[Measurement: Creatinine] [Value: >= 2 x upper limit of normal (ULN)]